American Society of Anesthesiologist (ASA) status I-II adult patients undergoing elective laparoscopic cholecystectomy.

The above is a clinical trial inclusion criterion. Annotated with entity spans:
[Measurement: American Society of Anesthesiologist (ASA)] [Value: status I-II] [Person: adult] patients undergoing [Qualifier: elective] [Procedure: laparoscopic cholecystectomy].